Clinical trial exclusion criterion:
Mixed phenotype acute leukemia (MPAL)

Annotated entities:
- Condition: "Mixed phenotype acute leukemia"
- Condition: "MPAL"